Clinical trial exclusion criterion:
Fasting blood glucose >126 mg/dL at screening. Heterozygous subjects will be excluded for a fasting blood glucose >140 mg/dL.

Entity relations:
- Has_value("Fasting blood glucose", ">126 mg/dL")
- Has_temporal("Fasting blood glucose", "at screening")
- Has_value("fasting blood glucose", ">140 mg/dL")
- AND("Heterozygous", "fasting blood glucose")